Known hyperoxaluria

The above is a clinical trial exclusion criterion. Annotated with entity spans:
Known [Condition: hyperoxaluria]